Patients must not have a serious medical or psychiatric illness which prevents informed consent or compliance with treatment.

The above is a clinical trial inclusion criterion. Annotated with entity spans:
[Post-eligibility: Patients must not have a serious medical or psychiatric illness which prevents informed consent or compliance with treatment.]